Language barrier

The above is a clinical trial exclusion criterion. Annotated with entity spans:
[Non-query-able: Language barrier]